Women with childbearing potential or their male partners, who refuse to use an effective birth control method

The above is a clinical trial exclusion criterion. Annotated with entity spans:
[Pregnancy_considerations: Women with childbearing potential or their male partners, who refuse to use an effective birth control method]